腦下垂體腫瘤壓迫視交叉（optic chiasma），最可能發生下列何種症狀？
A. 單眼視野全盲
B. 雙眼顳側視野偏盲（bitemporal hemianopia）
C. 雙眼同側視野偏盲（homonymous hemianopia）
D. 雙眼同側視野偏盲，但黃斑部視野保留（homonymous hemianopia with macula sparing）

正確答案：B. 雙眼顳側視野偏盲（bitemporal hemianopia）